Which factors contribute to the risk of very-early-onset inflammatory bowel disease?

Somatic mosaicism and common genetic variation contribute to the risk of very-early-onset inflammatory bowel disease. Very-early-onset inflammatory bowel disease (VEO-IBD) is a heterogeneous phenotype associated with a spectrum of rare Mendelian disorders.